Non-reassuring fetal assessment at the time of recruitment

The above is a clinical trial exclusion criterion. Annotated with entity spans:
[Value: Non-reassuring] [Measurement: fetal assessment] [Temporal: at the time of recruitment]